Clinical trial inclusion criterion:
Resident in Scotland with a Community Health Index (CHI) number

Annotated entities:
- Person: "Resident"
- Visit: "Scotland"
- Non-representable: "Community Health Index (CHI) number"